Clinical trial inclusion criterion:
Known or suspected clinically unstable systemic medical disorder

Entity relations:
- Has_qualifier("medical disorder", "systemic")
- Has_qualifier("medical disorder", "clinically unstable")
- Has_mood("medical disorder", "Known")
- OR("Known", "suspected")